一名中年流浪漢因腹瀉、神智不清被送至急診室，檢查發現他的臉、前胸、手背都有皮膚粗糙的皮膚炎、舌頭也有發炎，醫師的診斷為：疑似癩皮病（pellagra）。下列有關此病之敘述，何者正確？
A. 此病是缺乏菸鹼酸（niacin）所造成
B. 菸鹼酸是由菸鹼醯胺腺嘌呤二核甘酸鹽（nicotinamide adenine dinucleotide，即NAD+）所合成
C. 以玉米為主食的人不易得此病
D. 神經系統不會受到影響

正確答案：A. 此病是缺乏菸鹼酸（niacin）所造成